Active LN with proteinuria (urine protein/creatinine ratio >1.0 or 24-hr urine protein >1.0 g at baseline), with or without hematuria.

The above is a clinical trial inclusion criterion. Annotated with entity spans:
[Qualifier: Active] [Condition: LN] with [Condition: proteinuria] ([Measurement: urine protein/creatinine ratio] [Value: >1.0] or [Measurement: 24-hr urine protein] [Value: >1.0 g] at baseline), with or without [Condition: hematuria].